Clinical trial exclusion criterion:
Allergic to or intolerant of investigational medications

Entity relations:
- AND("Allergic", "investigational medications")
- OR("Allergic", "intolerant")